Pregnancy, breast-feeding.

The above is a clinical trial exclusion criterion. Annotated with entity spans:
[Condition: Pregnancy], [Observation: breast-feeding].